Liver biopsy at any time showing mHAI stage 4 or higher fibrosis OR

The above is a clinical trial exclusion criterion. Annotated with entity spans:
[Procedure: Liver biopsy] at [Temporal: any time] showing [Measurement: mHAI stage] [Value: 4 or higher] fibrosis OR